Clinical trial inclusion criteria:
(1) cases of infertility, older than 20 years of age and not older than 40 years.
(2) Body mass index (BMI):20-29.
(3) women have experienced two or more implantation failure attributed to inadequate endometrial development.

Annotated entities:
- Condition: "infertility"
- Value: "older than 20 years"
- Person: "age"
- Value: "not older than 40 years"
- Measurement: "Body mass index"
- Measurement: "BMI"
- Value: "20-29"
- Person: "women"
- Multiplier: "two or more"
- Procedure: "implantation"
- Qualifier: "failure"
- Condition: "inadequate endometrial development"
- Mood: "attributed to"